根據 Watson-Crick 的 DNA 模式，有	關兩	股	核	苷酸鏈結 合	的	力	量，下列何者為非？
A. 各鹼基間所形成的氫鍵（hydrogen bonds between bases）
B. 鹼基間的堆積力量（Stacking of the bases）
C. 鹼基間所產生的凡得瓦爾交互作用（Van der Waals interaction）
D. 磷酸根與鹼基間之離子交互作用（ionic interaction）

正確答案：D. 磷酸根與鹼基間之離子交互作用（ionic interaction）